Severely carious teeth resulting in inability to isolate for procedure

The above is a clinical trial exclusion criterion. Annotated with entity spans:
[Qualifier: Severely] [Condition: carious teeth] resulting in [Condition: inability to isolate for procedure]